Clinical trial inclusion criterion:
Participants must be considered by their physician eligible to receiving the IRD regimen.

Annotated entities:
- Mood: "eligible to"
- Procedure: "IRD regimen"